Clinical trial exclusion criterion:
Subjects who aspartate transaminase/alkaline transaminase (AST/ALT) value is more than three times of the upper limit of the normal range at screening test

Annotated entities:
- Measurement: "aspartate transaminase/alkaline transaminase (AST/ALT)"
- Value: "more than three times of the upper limit of the normal range"
- Temporal: "at screening test"
- Reference_point: "screening test"